有關公衛倫理與傳統醫學倫理的差異，下列敘述何者錯誤？
A. 公衛倫理通常牽涉公益與人權的權衡；傳統醫學倫理通常規範醫師對病患個人的倫理義務
B. 公衛倫理比較強調群體健康及健康資源配置的公平性；傳統醫學倫理比較偏重尊重病患自主
C. 公衛倫理中，公益絕對優先於個人權益；傳統醫學倫理中，個人權益絕對優先於公益
D. 公衛倫理通常規範國家與個人間的關係；傳統醫學倫理通常規範個別醫病關係

正確答案：C. 公衛倫理中，公益絕對優先於個人權益；傳統醫學倫理中，個人權益絕對優先於公益